Clinical trial inclusion criterion:
All children scheduled for outpatient MRI scans with expected duration of scan between 30 minutes and 75 minutes.

Entity relations:
- Has_qualifier("MRI scans", "outpatient")
- Has_value("expected duration of scan", "between 30 minutes and 75 minutes")